Las células de las glándulas sudoríparas ecrinas que segregan proteínas son las:
1. Claras.
2. Mioepiteliales.
3. Oscuras.
4. De los conductos.

Respuesta correcta: 3. Oscuras.